Clinical trial inclusion criterion:
On standard immunosuppression with tacrolimus and prednisone

Annotated entities:
- Procedure: "standard immunosuppression"
- Drug: "tacrolimus"
- Drug: "prednison"